陰道的後壁隆起是由下列何者所造成？
A. 卵巢
B. 膀胱
C. 小腸
D. 直腸

正確答案：D. 直腸